下列有關健康成人正常睡眠的結構，何者正確？
A. 每個睡眠週期約60分鐘
B. 非動眼睡眠第三期約占睡眠50%的時間
C. 入睡通常小於5分鐘
D. 每晚經歷3～5個睡眠週期

正確答案：D. 每晚經歷3～5個睡眠週期